Concomitant drug therapy known to cause significant enzyme induction or inhibition of CYP 3A4.

The above is a clinical trial exclusion criterion. Annotated with entity spans:
[Temporal: Concomitant] [Measurement: drug therapy] known to cause significant [Observation: enzyme induction] or inhibition of CYP 3A4.